Clinical trial inclusion criterion:
Patients with (highly) active RRMS disease course indicated to receive alemtuzumab according to the following conditions (at least 1 out of 3 conditions has to be fulfilled): 1. =2 MS relapses within 24 months, 2. clinical (=1 relapse) or MRI (new gadolinium enhancing lesions) disease activity under therapy with other diseasemodifying therapies, 3. severe relapse with high disease activity (=9 T2 hyperintense Lesions and =1 gadolinium enhancing lesion) on MRI.

Entity relations:
- Has_qualifier("RRMS", "active")
- AND("RRMS", "alemtuzumab")
- Has_multiplier("MS relapses", "=2")
- Has_temporal("MS relapses", "within 24 months,")
- Has_multiplier("relapse", "=1")
- Has_qualifier("lesions", "gadolinium enhancing")
- Has_qualifier("lesions", "new")
- AND("MRI", "lesions")
- Has_qualifier("relapse", "severe")
- Has_qualifier("Lesions", "T2 hyperintense")
- Has_multiplier("Lesions", "=9")
- Has_qualifier("lesion", "gadolinium enhancing")
- Has_multiplier("lesion", "=1")
- AND("MRI", "Lesions")
- AND("relapse", "MRI")
- AND("MRI", "lesion")
- OR("relapse", "MRI")